Clinical trial exclusion criterion:
Ongoing anaemia as indicated by haemoglobin values below the lower limit of the laboratory-specified reference range. If the finger prick method demonstrates an anaemia, no further protocol procedures will be performed, and the subject will be referred for appropriate medical management. The subject may participate in this study following therapy and evidence that the anaemia has been resolved.

Entity relations:
- Has_temporal("anaemia", "Ongoing")
- Has_value("haemoglobin", "below the lower limit of the laboratory-specified reference range")
- AND("anaemia", "haemoglobin")
- AND("finger prick method", "anaemia")
- OR("anaemia", "finger prick method")